Clinical trial exclusion criterion:
Previous sub-urethral sling

Entity relations:
- Has_temporal("sub-urethral sling", "Previous")